Clinical trial exclusion criterion:
Chronic renal failure (GFR < 30 ml/min)

Annotated entities:
- Condition: "renal failure"
- Multiplier: "Chronic"
- Measurement: "GFR"
- Value: "< 30 ml/min"